一位 25 歲年輕男性，主訴近二星期因發燒、喉痛、咳嗽帶黃痰，到內科診治，包括服用抗生素、退燒、止痛劑及止咳藥物等，治療後以上之病情已漸好；不幸最近 4~5 天在飲食時會感到胸口疼痛，而且有點吞嚥困難；試問最近 4~5 天所發生之症狀最可能原因為何？
A. 心臟病
B. 食道腫瘤
C. 逆流性食道炎
D. 藥物引起之食道潰瘍

正確答案：D. 藥物引起之食道潰瘍